Clinical trial exclusion criterion:
HbA1c > 75 mmol/mol

Annotated entities:
- Measurement: "HbA1c"
- Value: "> 75 mmol/mol"